Clinical trial exclusion criterion:
HIV seropositivity

Annotated entities:
- Measurement: "HIV"
- Value: "seropositivity"